¿Qué tipo de enfermedades producen más comúnmente en el ser humano las especies del género Campylobacter?
1. Infecciones urinarias.
2. Infecciones de transmisión sexual.
3. Gastroenteritis aguda.
4. Abortos.

Respuesta correcta: 3. Gastroenteritis aguda.